Which SWI/SNF protein complex subunit has been demonstrated to interact with the FANCA gene product?

FANCA was demonstrated to associate with the endogenous SWI/SNF complexFANCA may recruit the SWI/SNF complex to target genes, thereby enabling coupled nuclear functions such as transcription and DNA repair